Clinical trial exclusion criterion:
Any history of cervical, penile, oral or anal cancers

Annotated entities:
- Temporal: "Any history"
- Condition: "cancers cervical"
- Condition: "penile cancers"
- Condition: "oral cancers"
- Condition: "anal cancers"